1. Patients with C class by child-pugh score

The above is a clinical trial exclusion criterion. Annotated with entity spans:
1. Patients with [Value: C class] by [Measurement: child-pugh score]